Clinical trial exclusion criterion:
Actively trying to achieve pregnancy

Annotated entities:
- Pregnancy_considerations: "Actively trying to achieve pregnanc"